Established T2DM (=3months)

The above is a clinical trial inclusion criterion. Annotated with entity spans:
Established [Condition: T2DM] ([Temporal: =3months])